Clinical trial inclusion criterion:
Patients diagnosed at the out-patient cystoscopy with papillary bladder tumour will be legible for inclusion

Annotated entities:
- Visit: "out-patient"
- Procedure: "cystoscopy"
- Condition: "papillary bladder tumour"